Clinical trial exclusion criterion:
Contraindications to injecting Dotarem ®

Entity relations:
- AND("Contraindications", "Dotarem")